Clinical trial exclusion criterion:
Implanted cardiac pacemaker of defibrillator

Entity relations:
- OR("cardiac pacemaker", "defibrillator")